previous transfusion of blood products

The above is a clinical trial exclusion criterion. Annotated with entity spans:
[Temporal: previous] [Procedure: transfusion of blood products]